Which disease is gemtuzumab ozogamicin used for?

Gemtuzumab ozogamicin is used for the treatment of acute myeloid leukemia